Clinical trial inclusion criterion:
Age 1 day to less than 18 years

Entity relations:
- Has_value("Age", "1 day to less than 18 years")